Subjects who require a legally authorized representative to obtain consent

The above is a clinical trial exclusion criterion. Annotated with entity spans:
[Non-query-able: Subjects who require a legally authorized representative to obtain consent]